Patients with pulmonary hypertension or unstable cardiopulmonary conditions

The above is a clinical trial exclusion criterion. Annotated with entity spans:
Patients with [Condition: pulmonary hypertension] or [Condition: unstable cardiopulmonary conditions]